Clinical trial exclusion criterion:
Patients with concomitant HIV infection or congenital immune deficiency diseases.

Entity relations:
- Has_qualifier("HIV infection", "concomitant")
- OR("HIV infection", "congenital immune deficiency diseases")